Clinical trial inclusion criterion:
Healthy at inclusion

Annotated entities:
- Condition: "Healthy"
- Temporal: "at inclusion"